• History of physician-diagnosed inflammatory bowel disease (IBD)

The above is a clinical trial inclusion criterion. Annotated with entity spans:
• [Temporal: History] of physician-diagnosed [Condition: inflammatory bowel disease (IBD)]